Clinical trial exclusion criterion:
Known hypersensitivity to pembrolizumab or another mAb.

Entity relations:
- AND("hypersensitivity to pembrolizumab", "pembrolizumab")
- AND("hypersensitivity to mAb", "mAb")
- OR("hypersensitivity to pembrolizumab", "hypersensitivity to mAb")